Clinical trial exclusion criterion:
AF secondary to electrolyte imbalance, thyroid disease, or reversible or non-cardiac cause.

Annotated entities:
- Condition: "AF"
- Condition: "electrolyte imbalance"
- Qualifier: "secondary"
- Condition: "thyroid disease"
- Condition: "non-cardiac cause"
- Qualifier: "reversible"